Clinical trial exclusion criterion:
Psychotic disorders (e.g., schizophrenia)

Annotated entities:
- Condition: "Psychotic disorders"
- Condition: "schizophrenia"